Clinical trial inclusion criterion:
2. hypertriglyceridemia (triglyceride levels of 150 mg⁄dL or greater);

Annotated entities:
- Condition: "hypertriglyceridemia"
- Measurement: "triglyceride levels"
- Value: "150 mg⁄dL or greater"